Monitoring of intracranial temperature and pressure by intraparenchymal sensor (Sophysa®)

The above is a clinical trial inclusion criterion. Annotated with entity spans:
Monitoring of [Measurement: intracranial temperature] and pressure by [Device: intraparenchymal sensor] ([Device: Sophysa®])